肺小細胞癌（small cell carcinoma of lung）患者，如果發生近端四肢無力，但是沒有感覺異常，重複神經電刺激檢查（repetitive nerve stimulation），發現有反應漸增（incremental response）現象，則可能是下列何種疾病？
A. Lambert-Eaton myasthenic syndrome
B. Polymyositis
C. Chronic inflammatory demyelinating polyneuropathy
D. Polyradiculoneuropathy

正確答案：A. Lambert-Eaton myasthenic syndrome